Clinical trial exclusion criterion:
It is impossible to correctly inform the patient or his/her representative

Annotated entities:
- Post-eligibility: "It is impossible to correctly inform the patient or his/her representative"